Clinical trial inclusion criterion:
Healthy men and women, age 40-75 yrs, without any disease and need of medication.

Entity relations:
- Has_value("age", "40-75 yrs")
- Has_mood("medication", "need of")
- Has_negation("any disease", "without")
- OR("any disease", "medication")
- OR("men", "women")